Clinical trial exclusion criterion:
Anticoagulant therapy (e.g. Warfarin, Plavix, etc.), will not be automatic exclusion but patients will be required to have INR test performed and have values between 2.0 to 3. Physician consultation will be requested to determine whether anticoagulant therapy can be discontinued for 3 days prior to surgery.

Annotated entities:
- Procedure: "Anticoagulant therapy"
- Drug: "Warfarin"
- Drug: "Plavix"
- Grammar_Error: "will not be automatic exclusion"
- Measurement: "INR test"
- Value: "between 2.0 to 3"
- Procedure: "anticoagulant therapy"
- Not_a_criteria: "Physician consultation will be requested to determine whether anticoagulant therapy can be discontinued for 3 days prior to surgery."
- Non-query-able: "Physician consultation will be requested to determine whether anticoagulant therapy can be discontinued for 3 days prior to surgery."